RA cohort: Previous intolerance to MTX

The above is a clinical trial exclusion criterion. Annotated with entity spans:
[Condition: RA] cohort: Previous [Condition: intolerance] to [Drug: MTX]